Clinical trial exclusion criterion:
Pregnant or lactating women, women of childbearing potential not employing adequate contraception

Annotated entities:
- Condition: "Pregnant"
- Condition: "lactating"
- Person: "women"
- Condition: "childbearing potential"
- Person: "women"
- Procedure: "contraception"
- Negation: "not employing"